Concurrent participation in other investigational study

The above is a clinical trial exclusion criterion. Annotated with entity spans:
[Competing_trial: Concurrent participation in other investigational study]